Clinical trial exclusion criterion:
Serum phosphate <3.0 mg/dL

Entity relations:
- Has_value("Serum phosphate", "<3.0 mg/dL")